Clinical trial inclusion criterion:
Adequate hepatic, bone marrow, and renal function

Annotated entities:
- Measurement: "renal function"
- Measurement: "bone marrow function"
- Measurement: "function hepatic"
- Value: "Adequate"